Subjects who have any other condition which the investigator judges would make patients unsuitable for study participation

The above is a clinical trial exclusion criterion. Annotated with entity spans:
Subjects who have [Condition: any other condition] which [Qualifier: the investigator judges would make patients unsuitable for study participation]